Prior treatment for lymphoid malignancy for progressive /refractory disease

The above is a clinical trial inclusion criterion. Annotated with entity spans:
[Temporal: Prior] [Procedure: treatment] for [Condition: lymphoid malignancy] for [Condition: progressive] /[Condition: refractory disease]